Un episodio hipomaniaco se caracteriza por:
1. Un periodo de estado de animo anormal y persistentemente elevado, expansivo o irritable, con aumento de la actividad o la energía, que dura como mínimo una semana y está presente la mayor parte del día, casi todos los días.
2. Un periodo de estado de animo anormal y persistentemente elevado, expansivo o irritable, con aumento de la actividad o la energía, que dura como mínimo cuatro días consecutivos y está presente la mayor parte del día, casi todos los días.
3. Un periodo, de dos años como mínimo, durante el cual han existido numerosos periodos con síntomas de ánimo elevado, con numerosos periodos con síntomas de ánimo deprimido y han estado presentes la mayor parte del día, casi todos los días.
4. Un periodo de estado de ánimo deprimido la mayor parte del día, casi todos los días, con disminución importante del interés o el placer por todas o casi todas las actividades durante la mayor parte del día, casi todos los días.

Respuesta correcta: 2. Un periodo de estado de animo anormal y persistentemente elevado, expansivo o irritable, con aumento de la actividad o la energía, que dura como mínimo cuatro días consecutivos y está presente la mayor parte del día, casi todos los días.